Clinical trial inclusion criterion:
Women above 18 years of age with biopsy proven, clinically stage 1 or 2 breast cancer who will be undergoing partial mastectomy with SLNBx at Memorial Health

Entity relations:
- AND("above 18 years", "age")
- Has_qualifier("breast cancer", "stage 1")
- AND("biopsy", "breast cancer")
- AND("partial mastectomy", "SLNBx")
- Has_mood("partial mastectomy", "will be undergoing")
- AND("breast cancer", "partial mastectomy")
- OR("stage 1", "stage 2")